What membrane proteins constitute TAM family of receptor tyrosine kinases (RTKs)?

TAM-family RTKs AXL and Mer (MerTK).